下列何者起自第五頸神經根（C5 root），且在頸部經常穿過中斜角肌（middle scalene muscle）後支配肩胛提肌（levator scapulae muscle）？
A. 肩胛上神經（suprascapular nerve）
B. 胸長神經（long thoracic nerve）
C. 背肩胛神經（dorsal scapular nerve）
D. 鎖骨下肌神經（nerve to subclavius）

正確答案：C. 背肩胛神經（dorsal scapular nerve）